Willing and capable of providing informed consent

The above is a clinical trial inclusion criterion. Annotated with entity spans:
[Informed_consent: Willing and capable of providing informed consent]